Clinical trial inclusion criterion:
>/= 18 years old

Annotated entities:
- Value: ">/= 18 years old"
- Person: "old"